Clinical trial exclusion criterion:
Person in an emergency, life threatening situation.

Annotated entities:
- Observation: "life threatening situation"
- Observation: "emergency situation"